Alcohol or drug dependency

The above is a clinical trial exclusion criterion. Annotated with entity spans:
[Condition: Alcohol] or [Condition: drug dependency]